Clinical trial inclusion criterion:
Male or female >=18 years of age.

Annotated entities:
- Person: "Male"
- Person: "female"
- Value: ">=18 years"
- Person: "age"